Clinical trial exclusion criterion:
Patients who received chemotherapy less than 6 weeks ago.

Annotated entities:
- Procedure: "chemotherapy"
- Temporal: "less than 6 weeks ago"